Clinical trial exclusion criterion:
Non-cirrhotic portal hypertension causing esophageal varices

Annotated entities:
- Condition: "Non-cirrhotic portal hypertension"
- Condition: "esophageal varices"